一新生兒有腹漲現象，在出生後 30 小時才排出胎便，則最可能的診斷是：
A. 直腸閉鎖（rectal atresia）
B. 巨結腸症（Hirschsprung's disease）
C. 腸套疊（intussusception）
D. 腸轉位異常（malrotation）

正確答案：B. 巨結腸症（Hirschsprung's disease）